Clinical trial inclusion criteria:
Healthy patients
aged 3-13 years
Level I or level II on the American Society of Anesthesiologists (ASA) physical status classification system (as determined by the anesthesiologist)
obstructive sleep apnea or recurrent throat infections
undergoing elective tonsillectomy with or without adenoidectomy
Parents who agree to complete documentation and follow up at 14 days post-operation.

Annotated entities:
- Condition: "Healthy"
- Person: "aged"
- Value: "3-13 years"
- Measurement: "American Society of Anesthesiologists (ASA) physical status"
- Value: "Level I or level II"
- Condition: "obstructive sleep apnea"
- Multiplier: "recurrent"
- Condition: "throat infections"
- Qualifier: "elective"
- Condition: "tonsillectomy"
- Condition: "adenoidectomy"
- Informed_consent: "Parents who agree to complete documentation and follow up at 14 days post-operation."